contraindication to the study drug

The above is a clinical trial exclusion criterion. Annotated with entity spans:
[Condition: contraindication] to the [Drug: study drug]